Hemidiaphragmatic dysfunction, suspected or known PNP

The above is a clinical trial exclusion criterion. Annotated with entity spans:
[Condition: Hemidiaphragmatic dysfunction], [Qualifier: suspected] or [Qualifier: known] [Condition: PNP]